車禍造成胸鎖乳突肌上1/3處的撕裂傷後，下頜骨角（angle of mandible）處的皮膚感覺喪失，下列何者最可能受傷？
A. 頦神經（mental nerve）
B. 面神經（facial nerve）
C. 枕小神經（lesser occipital nerve）
D. 耳大神經（great auricular nerve）

正確答案：D. 耳大神經（great auricular nerve）